En el tratamiento de una sobredosis de paracetamol se utiliza:
1. Flumazenil.
2. Edetato sodio calcio.
3. Pralidoxima.
4. N-acetilcisteína.
5. Nitro de amilo.

Respuesta correcta: 4. N-acetilcisteína.